Which protein complexes recognize centromeric (CEN) DNA in yeast?

The Schizosaccharomyces pombe centromere-linked genes, LYS1 and CYH1 on chromosome I and TPS13 and RAN1 on chromosome II, have been isolated